Respiratory culture(s) demonstrating evidence of Pseudomonas aeruginosa or Achromobacter species airway infection.

The above is a clinical trial inclusion criterion. Annotated with entity spans:
[Measurement: Respiratory culture(s)] demonstrating evidence of [Value: Pseudomonas aeruginosa] or [Value: Achromobacter species] [Condition: airway infection].